黃先生是一位慢性 B 型肝炎的患者，最近公司的例行身體檢查發現血紅素只有 10 g/dL，而黃先生並無明顯不適。於是再到大醫院做進一步檢查，發現平均紅血球體積（MCV）：92 fL、total iron-binding capacity（TIBC）：210μg/dL（正常值 250~450）、ferritin：300 ng/mL（正常值 20~250）、serum iron μg/dL（正常值 65~175）。黃先生發生貧血最可能的原因是：
A. 缺鐵性貧血（iron deficiency anemia）
B. 地中海性貧血（thalassemia）
C. 實驗室誤差（laboratory errors）
D. 慢性病相關的貧血（anemia of chronic diseases）

正確答案：D. 慢性病相關的貧血（anemia of chronic diseases）